Clinical trial inclusion criterion:
All pacing capture thresholds (PCT) do not exceed 2.0 V @0.4 or 0.5 ms in pacemaker dependent patients

Annotated entities:
- Measurement: "pacing capture thresholds"
- Measurement: "PCT"
- Value: "do not exceed 2.0 V @0.4 or 0.5 ms"
- Condition: "pacemaker dependent"